Clinical trial inclusion criterion:
can operate patient-controlled analgesia (PCA) machine

Annotated entities:
- Non-query-able: "can operate patient-controlled analgesia (PCA) machine"